Clinical trial exclusion criterion:
unilateral ovariectomy

Annotated entities:
- Qualifier: "unilateral"
- Procedure: "ovariectomy"